Which gene is involved in the development of Barth syndrome?

Tafazzin, a mitochondrial acyltransferase encoded by a gene of the same name, plays an important role in cardiolipin side chain remodeling. Studies have shown that mutation-induced dysfunction of tafazzin reduces cardiolipin content, impairs mitochondrial function, and causes dilated cardiomyopathy in Barth syndrome (BTHS).